4. Acute decompensated heart failure within 1 month of Screening.

The above is a clinical trial exclusion criterion. Annotated with entity spans:
[Parsing_Error: 4.] [Qualifier: Acute] [Qualifier: decompensated] [Condition: heart failure] [Temporal: within 1 month of Screening].